五十歲男性病人，B 型肝炎帶原三十年之久，被送到急診，主訴今天清晨開始吐鮮血、冒冷汗。理學檢查血壓 92/54 mmHg，心跳 131 次/min，臉色蒼白，皮膚略顯黃色，腹部脹大且有敲打鈍音移位 （shifting dullness）現象，實驗室血液檢查 Hb 7.5 gm/dL，platelet 80000/ 1，albumin 2.5 mg/dL，globulin 
 6 mg/dL，total bilirubin 2.3 mg/dL，PT 16.3/11.8 sec，PTT 32.5/32.0 sec。此病人最可能的診斷為：
A. 食道胃靜脈瘤出血（bleeding esophagogastric varices）
B. 消化性潰瘍出血（bleeding peptic ulcer）
C. 急性胃黏膜病變（acute gastric mucosa lesion）
D. Mallory-Weiss 症候群（Mallory-Weiss syndrome）

正確答案：A. 食道胃靜脈瘤出血（bleeding esophagogastric varices）